下列有關上頸神經節（superior cervical ganglion）的敘述，何者錯誤？
A. 不在頸動脈鞘（carotid sheath）內
B. 頭最長肌（longus capitis）通常在它的前面
C. 節後神經與CN IX及CN X共同形成咽神經叢（pharyngeal plexus）
D. 節後神經會經由CN V的分支到唾液腺

正確答案：B. 頭最長肌（longus capitis）通常在它的前面